Clinical trial inclusion criterion:
Patients diagnosed severe sepsis / septic shock at admission on Intensive Care Unit who can be enrolled within 90 min after admission OR patients diagnosed severe sepsis / septic shock during Intensive Care Unit stay who can be enrolled within 90 min after diagnosis

Annotated entities:
- Condition: "severe sepsis"
- Condition: "septic shock"
- Temporal: "at admission on Intensive Care Unit"
- Reference_point: "admission on Intensive Care Unit"
- Non-representable: "be enrolled within 90 min after admission"